Age <18 years or >75 years

The above is a clinical trial exclusion criterion. Annotated with entity spans:
[Person: Age] [Value: <18 years] or [Value: >75 years]